陳老先生罹患肝細胞癌，於接受肝動脈栓塞治療術後半個小時，發生意識障礙的情況，經電腦斷層檢查發現腦部血管栓塞的現象，疑似肝動脈栓塞時所打進的藥物，部分流到腦部血管所致。因為腦中風的範圍相當廣泛，陳老先生隨即發生呼吸衰竭，隨後病況不斷惡化，最後死亡。肝動脈栓塞治療術所導致的腦栓塞個案相當罕見，對於這種很少見，但最後致命的併發症，依照目前相關法規或者法院的看法，是否屬於應該告知的範圍？
A. 屬於應該告知的併發症範圍，因為該併發症相當罕見，所以應該告知
B. 屬於應該告知的併發症範圍，該併發症雖然罕見，但是其發生後的後果相當嚴重，應該告知
C. 不屬於應該告知的併發症範圍，因為過於罕見
D. 不屬於應該告知的併發症範圍，因為如果告知該併發症，病患就會決定不接受肝動脈栓塞治療術

正確答案：B. 屬於應該告知的併發症範圍，該併發症雖然罕見，但是其發生後的後果相當嚴重，應該告知